陣發性心室上性心搏過速症患者，如合併有低血壓及心臟衰竭之狀況，應優先考慮使用下列何項處置？
A. 靜脈注射 digoxin
B. 靜脈注射 verapamil
C. 心臟電擊整流（electrical cardioversion）
D. 行使 vagal maneuver

正確答案：C. 心臟電擊整流（electrical cardioversion）